Clinical trial exclusion criterion:
Administration of licensed vaccines within 2 weeks (for inactivated vaccines) or 4 weeks (for live vaccines) prior to enrolment in this study.

Entity relations:
- Has_temporal("inactivated vaccines", "within 2 weeks prior to enrolment in this study")
- Has_temporal("live vaccines", "within 4 weeks prior to enrolment in this study")
- AND("licensed vaccines", "inactivated vaccines")
- OR("inactivated vaccines", "live vaccines")